下列何者不是骨質疏鬆症（osteoporosis）的危險因子？
A. 酒精過度飲用
B. 吸菸
C. 身體質量指數（body mass index）介於22～24公斤／平方公尺
D. 父母親有髖部骨折史

正確答案：C. 身體質量指數（body mass index）介於22～24公斤／平方公尺